Clinical trial inclusion criteria:
Current DSM-IV diagnosis of cannabis dependence, >1 week detoxified and abstinent;
Able to provide written informed consent and to comply with study procedures.
Dutch speaking (Dutch as primary language).

Annotated entities:
- Qualifier: "DSM-IV"
- Condition: "cannabis dependence"
- Multiplier: ">1 week"
- Condition: "detoxified"
- Condition: "abstinent"
- Non-query-able: "Able to provide written informed consent and to comply with study procedures."
- Non-query-able: "Dutch speaking (Dutch as primary language)."